Clinical trial inclusion criterion:
aged 18 or older

Annotated entities:
- Value: "18 or older"
- Person: "aged"